Clinical trial exclusion criterion:
inability to walk independently for at least 10 minutes, with or without walking devices;

Annotated entities:
- Condition: "inability to walk independently"
- Qualifier: "at least 10 minutes"
- Device: "walking devices"